En la historia de la Evaluación Psicológica, la Fisiognomía aristotélica deja sentir su influencia en los trabajos posteriores de los autores:
1. Krestschmer y Sheldon.
2. Binet y Simon.
3. Descartes.
4. Juan Huarte de S. Juan.
5. Hermann Rorschach.

Respuesta correcta: 1. Krestschmer y Sheldon.